Clinical trial exclusion criterion:
Significant metabolic and endocrine diseases.

Annotated entities:
- Condition: "metabolic diseases"
- Condition: "endocrine diseases"